El principal tratamiento farmacológico para el trastorno obsesivo-compulsivo o TOC es:
1. Agonistas dopaminérgicos.
2. Bloqueadores de los receptores NMDA.
3. Inhibidores de la monoaminooxidasa o IMAOs.
4. Inhibidores selectivos de la recaptación de serotonina o 5-HT.
5. Neurolépticos.

Respuesta correcta: 4. Inhibidores selectivos de la recaptación de serotonina o 5-HT.